Clinical trial exclusion criterion:
taken adenosine diphosphate (ADP) receptor antagonists within 2 weeks

Entity relations:
- Has_temporal("adenosine diphosphate (ADP) receptor antagonists", "within 2 weeks")